Clinical trial exclusion criterion:
Current use of mixed agonist/antagonist (such as pentazocine, nalbuphine or butorphanol) and partial agonist (buprenorphine) analgesics

Annotated entities:
- Drug: "pentazocine"
- Drug: "nalbuphine"
- Drug: "butorphanol"
- Drug: "buprenorphine"